Clinical trial inclusion criterion:
Other protocol defined inclusion criteria could apply.

Annotated entities:
- Post-eligibility: "Other protocol defined inclusion criteria could apply."